Clinical trial exclusion criterion:
5. Osteomyelitis or prosthetic joint infection except new onset nonhardware-associated vertebral osteomyelitis.

Annotated entities:
- Condition: "Osteomyelitis"
- Condition: "prosthetic joint infection"
- Temporal: "new onset"
- Qualifier: "nonhardware-associated"
- Condition: "vertebral osteomyelitis"
- Negation: "except"